La pareidolia es una experiencia respecto de la que se puede afirmar que:
1. El individuo proporciona organización y significado a un estímulo ambiguo o poco estructurado.
2. Es una anomalía poco frecuente, que a veces aparece en los estados orgánicos y en la esquizofrenia.
3. El paciente es incapaz de establecer los nexos que habitualmente existen entre dos o más percepciones procedentes de modalidades sensoriales diferentes.
4. Las distintas cualidades sensoriales se funden en una única experiencia perceptiva.

Respuesta correcta: 1. El individuo proporciona organización y significado a un estímulo ambiguo o poco estructurado.